Perimenopausal women complaining of abnormal uterine bleeding (menorrhagia, metrorrhagia, polymenorrhoea or polymenorrhagia) without local gynecological cause.

The above is a clinical trial inclusion criterion. Annotated with entity spans:
[Person: Perimenopausal] [Person: women] complaining of [Condition: abnormal uterine bleeding] ([Condition: menorrhagia], [Condition: metrorrhagia], [Condition: polymenorrhoea] or [Condition: polymenorrhagia]) [Negation: without] [Condition: local gynecological cause].